Lack of consent

The above is a clinical trial exclusion criterion. Annotated with entity spans:
[Post-eligibility: Lack of consent]